In-ability to postpone anti-coagulation medications.

The above is a clinical trial exclusion criterion. Annotated with entity spans:
[Mood: In-ability to postpone] [Drug: anti-coagulation medications].